Clinical trial exclusion criterion:
HIV co-infection

Entity relations:
- Has_qualifier("co-infection", "HIV")